Presence of comorbidities that seriously affect the patient's safety or ability to complete the study, in the investigator's judgment;

The above is a clinical trial exclusion criterion. Annotated with entity spans:
[Non-query-able: Presence of comorbidities that seriously affect the patient's safety or ability to complete the study, in the investigator's judgment;]